Invasion of central nervous system;

The above is a clinical trial exclusion criterion. Annotated with entity spans:
[Condition: Invasion] of [Qualifier: central nervous system];